Clinical trial exclusion criterion:
Hypersensitivity to B-lactams

Entity relations:
- AND("Hypersensitivity", "B-lactams")